Lung reduction surgery

The above is a clinical trial exclusion criterion. Annotated with entity spans:
[Procedure: Lung reduction surgery]